Patients who in the judgment of the Investigator may be unreliable or uncooperative with the evaluation procedure outlined in this protocol;

The above is a clinical trial exclusion criterion. Annotated with entity spans:
[Non-query-able: Patients who in the judgment of the Investigator may be unreliable or uncooperative with the evaluation procedure outlined in this protocol];